Individuals with clinical signs of parafunctional habits;

The above is a clinical trial exclusion criterion. Annotated with entity spans:
Individuals with [Condition: clinical signs of parafunctional habits];